一位50歲男性的卡車司機，因打瞌睡於高速公路追撞前方聯結車，卡在前座達20分鐘，到達急診時，血壓80/40 mmHg、意識清楚但躁動不安、腹部脹大、左腿變形，下列何項敘述最不適當？
A. 應立即進行腦部電腦斷層檢查
B. 床邊腹部超音波可用於加速手術的決定
C. 中心靜脈導管的放置不應拖延進手術室的時間
D. 血氧飽和度92％可因為血壓低，故僅供參考

正確答案：A. 應立即進行腦部電腦斷層檢查